Clinical trial inclusion criterion:
18-45 yrs old

Annotated entities:
- Person: "old"
- Value: "18-45 yrs"